Clinical trial inclusion criteria:
Patients with PN during their hospitalization
Patients hospitalized in medical, surgical or ICU wards
Signed informed consent either from the patient, their legally authorized representative or a direct family member

Annotated entities:
- Procedure: "PN"
- Temporal: "during their hospitalization"
- Reference_point: "their hospitalization"
- Procedure: "hospitalization"
- Procedure: "hospitalized"
- Visit: "ICU wards"
- Visit: "surgical wards"
- Visit: "medical wards"
- Informed_consent: "Signed informed consent either from the patient, their legally authorized representative or a direct family member"